¿Cuál de los siguientes anticuerpos monoclonales presenta como una de sus principales indicaciones el tratamiento de la leucemia linfoide crónica?
1. Trastuzumab.
2. Bevacizumab.
3. Denosumab.
4. Cetuximab.
5. Rituximab.

Respuesta correcta: 5. Rituximab.